Symptomatic or asymptomatic metastatic breast cancer.

The above is a clinical trial inclusion criterion. Annotated with entity spans:
[Qualifier: Symptomatic] or [Qualifier: asymptomatic] [Condition: metastatic breast cancer].